當車禍事故的傷患被送至急診室急救時，如果發現呼吸道有異物、呼吸困難或神智不清時，應立即給予氣管內插管 （endotracheal intubation）。下列何項為外傷病患緊急插管時，最應該注意之事項？
A. 保護頸椎（cervical spine protection）
B. 注意腦壓升高
C. 注意吸入性肺炎（aspiration pneumonia）
D. 注意麻藥劑量過多

正確答案：A. 保護頸椎（cervical spine protection）